receiving venovenous or venoarterial ECMO

The above is a clinical trial inclusion criterion. Annotated with entity spans:
receiving [Procedure: venovenous] or [Procedure: venoarterial ECMO]